What is the function of BAX

pro-apoptotic protein Bax